Clinical trial exclusion criteria:
Operative findings not suggestive of endometriotic cyst
Contraindications to progestogens or oral contraceptive pills
Unwillingness to tolerate menstrual irregularity
Planning pregnancy within 2 years of study
Cannot understand English, Cantonese or Putonghua

Annotated entities:
- Condition: "Operative findings"
- Negation: "not"
- Mood: "suggestive"
- Condition: "endometriotic cyst"
- Condition: "Contraindications"
- Drug: "progestogens"
- Drug: "oral contraceptive pills"
- Condition: "menstrual irregularity"
- Mood: "Unwillingness to tolerate"
- Mood: "Planning"
- Condition: "pregnancy"
- Temporal: "within 2 years of study"
- Non-query-able: "Cannot understand English, Cantonese or Putonghua"